老年人健康與照護問題的重要特徵為：
A. 老年人健康問題常合併身心社會問題，其表現症狀以非特異性居多
B. 老年人生病時的表現以一般典型症狀表現居多
C. 老年人之功能儲備或預留力（reservoir）很足夠
D. 老年人健康問題之處理不須考慮長期照護之安排

正確答案：A. 老年人健康問題常合併身心社會問題，其表現症狀以非特異性居多